Clinical trial exclusion criterion:
Contraindication to or planned discontinuation of dual antiplatelet therapy within 1 year

Entity relations:
- AND("dual antiplatelet therapy", "Contraindication")
- Has_temporal("dual antiplatelet therapy", "within 1 year")
- OR("Contraindication", "planned discontinuation")